Clinical trial exclusion criterion:
Allergy to tested material

Annotated entities:
- Condition: "Allergy"
- Drug: "tested material"
- Reference_point: "tested material"
- Context_Error: "tested material"